History of BCG sepsis

The above is a clinical trial exclusion criterion. Annotated with entity spans:
[Temporal: History] of [Condition: BCG] [Condition: sepsis]